Clinical trial exclusion criterion:
With the history of cognitive disorders

Annotated entities:
- Condition: "cognitive disorders"